What is detected by the UV-damaged DNA-binding protein (UV-DDB) complex?

Upon UV irradiation of primate cells,  UV-DDB associates tightly with chromatin and is involved in global genomic nucleotide excision repair (NER) in mammalian cells.